Clinical trial inclusion criterion:
office blood pressure = 150/95 mmHg (confirmed on a second day; 24h ambulatory blood pressure measurement (ABPM) is allowed to check accuracy of office values; inclusion with 24h mean blood pressure = 145/90 mm Hg is possible); patients with hypertension should be treated according to current treatment guidelines

Annotated entities:
- Measurement: "blood pressure"
- Value: "= 150/95 mmHg"
- Non-query-able: "(confirmed on a second day; 24h ambulatory blood pressure measurement (ABPM) is allowed to check accuracy of office values; inclusion with 24h mean blood pressure = 145/90 mm Hg is possible); patients with hypertension should be treated according to current treatment guidelines"